Clinical trial exclusion criterion:
Use of aspirin or salicylate- containing products within 30 days before enrollment

Entity relations:
- Has_temporal("aspirin", "within 30 days before enrollment")
- OR("aspirin", "salicylate- containing products")